Which components of the stress granules are known to be related to motor neuron degeneration in Amyotrophic Lateral Sclerosis?

Of note, both ALS and FTD are characterized by pathological inclusions, where some well-known SG markers localize with the ALS related proteins TDP-43 and FUS.